Clinical trial exclusion criterion:
adults 61 years old and above

Entity relations:
- Has_value("old", "and above 61 years")